下列何者不是甲狀頸幹（thyrocervical trunk）的分支？
A. 深頸動脈（deep cervical artery）
B. 肩胛上動脈（suprascapular artery）
C. 橫頸動脈（transverse cervical artery）
D. 甲狀腺下動脈（inferior thyroid artery）

正確答案：A. 深頸動脈（deep cervical artery）